多因子遺傳疾病，是指有數個遺傳因子和環境因子所共同決定的疾病。下列那一項疾病通常不被列入多因子遺傳疾病？
A. 成人型糖尿病
B. 精神分裂症
C. 神經纖維瘤症
D. 高血壓

正確答案：C. 神經纖維瘤症